Clinical trial exclusion criterion:
Subject has significant peripheral neuropathy, patient defined as a patient with Type I or Type II diabetes or similar systemic metabolic condition causing decreased sensation in a stocking-like or non-radicular and non-dermatomal distribution in the lower extremities.

Annotated entities:
- Qualifier: "significant"
- Condition: "peripheral neuropathy"
- Qualifier: "Type II"
- Qualifier: "Type I"
- Condition: "diabetes"
- Condition: "systemic metabolic condition"
- Qualifier: "similar"
- Condition: "decreased sensation"
- Qualifier: "stocking-like distribution"
- Qualifier: "non-radicular distribution"
- Qualifier: "non-dermatomal distribution"
- Qualifier: "lower extremities"